Clinical trial exclusion criterion:
Hospitalization for myocardial infarction or cardiac surgery within previous 90 days

Annotated entities:
- Observation: "Hospitalization"
- Condition: "myocardial infarction"
- Procedure: "cardiac surgery"
- Temporal: "within previous 90 days"